Clinical trial exclusion criterion:
Allergy or hypersensitivity to topiramate

Entity relations:
- AND("Allergy", "topiramate")
- OR("Allergy", "hypersensitivity")